En comparación con los anticuerpos policlonales, un anticuerpo monoclonal:
1. Tiene coste bajo.
2. Es de especificidad heterogénea.
3. Es de especificidad variable.
4. Reconoce un único epítopo.
5. Es de afinidad variable.

Respuesta correcta: 4. Reconoce un único epítopo.